膀胱癌實驗室檢查項目中最常見之異常為：
A. 貧血
B. 尿路感染
C. 血尿
D. 氮血症（azotemia）

正確答案：C. 血尿